下列那一種神經元的軸突末端，不是以acetylcholine為其釋出的主要神經傳導物質？
A. alpha-motor neurons
B. gamma-motor neurons
C. preganglionic parasympathetic neurons
D. postganglionic sympathetic neurons

正確答案：D. postganglionic sympathetic neurons